List the stages/types of Multiple Sclerosis.

Multiple Sclerosis (MS) is divided into three stages: primary progressive, relapsing-remitting, relapping-Remitting MS, and secondary progressive MS.